Clinical trial exclusion criterion:
Screening HgA1c blood test > 10.0

Annotated entities:
- Temporal: "Screening"
- Measurement: "HgA1c blood test"
- Value: "> 10.0"